因缺血（ischemia）而引起之腦神經元（neuron）功能障礙之特徵不包括：
A. 神經元釋出刺激性神經傳導物質
B. 神經元鈣離子湧入
C. 神經元鈉離子湧入
D. 神經元鉀離子湧入

正確答案：D. 神經元鉀離子湧入